Clinical trial exclusion criterion:
History of chronic alcohol abuse and/or drug use;

Annotated entities:
- Condition: "alcohol abuse"
- Condition: "drug use"
- Qualifier: "chronic"